不孕症之治療可以注射 gonadotropin-releasing hormone（GnRH），以促進排卵。下列有關 GnRH receptor 的敘述何者錯誤？
A. GnRH receptor 是 membrane receptor
B. GnRH receptor 是經 G protein 傳遞訊息
C. GnRH receptor 接受 ligand 後，會活化 protein kinase A
D. GnRH receptor受ligand刺激後，細胞質內的Ca2+濃度會上升

正確答案：C. GnRH receptor 接受 ligand 後，會活化 protein kinase A